Clinical trial inclusion criterion:
Non-cardiac condition limiting life expectancy to less than one year, per physician judgment (e.g. cancer)

Entity relations:
- Has_temporal("life expectancy", "less than one year")
- Has_context("Non-cardiac condition", "life expectancy")